Clinical trial inclusion criterion:
Capable of understanding instructions and participating in the definition of a therapeutic goal (Boston Diagnostic Aphasia Examination (BDAE) < 3).

Entity relations:
- Subsumes("Boston Diagnostic Aphasia Examination", "BDAE")
- Has_value("Boston Diagnostic Aphasia Examination", "< 3")